contraceptive implant

The above is a clinical trial exclusion criterion. Annotated with entity spans:
[Device: contraceptive implant]